Clinical trial exclusion criterion:
Participation in any ongoing investigational drug trial/study or clinical drug trial/study

Annotated entities:
- Competing_trial: "Participation in any ongoing investigational drug trial/study or clinical drug trial/study"